Psychotic symptoms occurring at any time during the current major depressive episode.

The above is a clinical trial exclusion criterion. Annotated with entity spans:
[Condition: Psychotic symptoms] occurring [Temporal: at any time during the current major depressive episode].